Sedentary lifestyle, defined as <150 min/wk of moderate physical activity as assessed by CHAMPS questionnaire

The above is a clinical trial inclusion criterion. Annotated with entity spans:
[Condition: Sedentary lifestyle], defined as [Value: <150 min/wk] of [Measurement: moderate physical activity] as assessed by [Procedure: CHAMPS questionnaire]